Clinical trial exclusion criterion:
Bismuth compounds, acid inhibitor, or antibiotics during 4 weeks before the patient is enrolled

Entity relations:
- Has_index("during 4 weeks before the patient is enrolled", "the patient is enrolled")
- Has_temporal("Bismuth compounds", "during 4 weeks before the patient is enrolled")
- OR("Bismuth compounds", "antibiotics", "acid inhibitor")